Clinical trial inclusion criterion:
Children born outside the cluster, and returning more than 72 hours after the delivery

Annotated entities:
- Non-query-able: "Children born outside the cluster, and returning more than 72 hours after the delivery"